Current treatment with drugs interfering with CYP3A4 metabolism (to avoid interaction with ticagrelor): Ketoconazole, itraconazole, voriconazole, clarithromycin, nefazodone, ritonavir, saquinavir, nelfinavir, indinavir, atazanavir, and telithromizycin.

The above is a clinical trial exclusion criterion. Annotated with entity spans:
Current treatment with [Drug: drugs] [Mood: interfering with] [Condition: CYP3A4 metabolism] ([Non-query-able: to avoid interaction with ticagrelor]): [Drug: Ketoconazole], [Drug: itraconazole], [Drug: voriconazole], [Drug: clarithromycin], [Drug: nefazodone], [Drug: ritonavir], [Drug: saquinavir], [Drug: nelfinavir], [Drug: indinavir], [Drug: atazanavir], and [Drug: telithromizycin].